Clinical trial exclusion criterion:
Patients who will require magnetic resonance imaging (MRI)

Annotated entities:
- Procedure: "magnetic resonance imaging"
- Procedure: "MRI"